Clinical trial exclusion criterion:
Body mass index less than 18 kg/m2 or greater than 30 kg/m2.

Entity relations:
- Has_value("Body mass index", "less than 18 kg/m2")
- OR("less than 18 kg/m2", "greater than 30 kg/m2")